Clinical trial inclusion criterion:
Objectively confirmed diagnosis of acute PE by multidetector CT angiography, ventilation/perfusion lung scan, or selective invasive pulmonary angiography, according to established diagnostic criteria, with or without symptomatic deep vein thrombosis

Entity relations:
- Has_qualifier("PE", "acute")
- AND("CT angiography", "PE")
- OR("CT angiography", "ventilation/perfusion lung scan", "invasive pulmonary angiography,")